Clinical trial exclusion criterion:
Use of statins and quinolones in the previous year;

Entity relations:
- Has_temporal("quinolones", "in the previous year")
- Has_temporal("statins", "in the previous year")